Clinical trial exclusion criterion:
Uncontrolled hypertension, defined as sustained blood pressure = 180/110 mm Hg (systolic BP = 180 mm Hg and/or diastolic BP = 110 mm Hg) prior to randomisation

Entity relations:
- Has_qualifier("hypertension", "Uncontrolled")
- Has_value("systolic BP", "= 180 mm Hg")
- Has_value("diastolic BP", "= 110 mm Hg")
- Has_value("blood pressure", "= 180/110 mm Hg")
- Subsumes("blood pressure", "systolic BP")
- AND("hypertension", "blood pressure")
- OR("systolic BP", "diastolic BP")